Clinical trial inclusion criterion:
Menopausal women with breast cancer treated and using tamoxifen or aromatase inhibitor.

Entity relations:
- AND("treated", "tamoxifen")
- OR("tamoxifen", "aromatase inhibitor")